Current systemic infection

The above is a clinical trial exclusion criterion. Annotated with entity spans:
Current [Condition: systemic infection]